Women pregnant or lactating, or women planning to become pregnant

The above is a clinical trial exclusion criterion. Annotated with entity spans:
[Person: Women] [Condition: pregnant] or [Condition: lactating], or [Person: women] [Mood: planning to become] [Condition: pregnant]